Clinical trial inclusion criterion:
Body Mass Index (BMI) = 35 kg/m2

Annotated entities:
- Measurement: "Body Mass Index (BMI)"
- Value: "= 35 kg/m2"